Which is the most important prognosis sub-classification in Chronic Lymphocytic Leukemia?

The mutational status of the immunoglobulin heavy variable (IGHV) genes, defines two subsets: mutated and unmutated CLL. Unmutated CLL patients show a shorter progression-free and overall survival than mutated CLL patients.